Treatment with statins during the past month prior to study.

The above is a clinical trial exclusion criterion. Annotated with entity spans:
Treatment with [Drug: statins] [Temporal: during the past month prior to study].